對於老年人睡眠之特色與年輕人比較，何者正確？
A. 熟睡期較多
B. 白天較想睡覺
C. 較少次之快速動眼期（Rapid eye movement, REM）
D. 較少發生與呼吸有關之睡眠障礙

正確答案：B. 白天較想睡覺